Clinical trial exclusion criterion:
Preoperative obstructive sleep apnea (previously diagnosed as obstructive sleep apnea, or a STOP-Bang score >= 3);

Entity relations:
- Has_temporal("obstructive sleep apnea", "Preoperative")
- Has_value("STOP-Bang score", ">= 3")
- Subsumes("obstructive sleep apnea", "obstructive sleep apnea")
- OR("obstructive sleep apnea", "STOP-Bang score")